下列何種內耳結構退化與老年失聰（presbycusis）最不相關？
A. 前庭神經節細胞（vestibular ganglion cells）
B. 血管紋（stria vascularis）
C. 內毛細胞（inner hair cells）
D. 外毛細胞（outer hair cells）

正確答案：A. 前庭神經節細胞（vestibular ganglion cells）